Clinical trial exclusion criterion:
Severe left ventricular hypertrophy (left ventricular septal wall thickness > 13mm)

Annotated entities:
- Condition: "left ventricular hypertrophy"
- Qualifier: "Severe"
- Measurement: "left ventricular septal wall thickness"
- Value: "> 13mm"